Clinical trial exclusion criterion:
Subjects with inflammatory bowel disease, active colitis, or pre-existing intra-abdominal inflammation. Diverticulitis without active infection/inflammation will not be excluded.

Annotated entities:
- Condition: "inflammatory bowel disease"
- Condition: "colitis"
- Temporal: "active"
- Condition: "intra-abdominal inflammation"
- Temporal: "pre-existing"
- Condition: "Diverticulitis"
- Temporal: "active"
- Condition: "infection"
- Condition: "inflammation"
- Negation: "not be excluded"
- Negation: "without"